What does a PET (Positron Excitation Tomography) measure?

Positron emission tomography pet (pet) is used to measure changes in regional brain glucose metabolism. It is used for the quantitative measurement of regional cerebral flow in awake rats.